Clinical trial exclusion criterion:
Active bronchospasm or history of hospitalization due to bronchospasm

Entity relations:
- AND("hospitalization", "bronchospasm")
- Has_temporal("hospitalization", "history")
- Has_qualifier("bronchospasm", "Active")
- OR("bronchospasm", "hospitalization")